下列何種狀況會發生發紺（cyanosis）？
A. 動脈血缺氧血紅素含量大於 5 g/dL
B. 一氧化碳中毒
C. 組織毒性缺氧
D. 嚴重貧血缺氧

正確答案：A. 動脈血缺氧血紅素含量大於 5 g/dL